Clinical trial exclusion criterion:
Pregnant or nursing females, or plan to become pregnant or nurse during the study period

Entity relations:
- Has_mood("become pregnant", "plan to")
- Has_temporal("become pregnant", "during the study period")
- OR("Pregnant", "nursing", "become pregnant")
- OR("become pregnant", "nurse")